關於甲狀腺機能亢進（hyperthyroidism）之敘述，下列何者錯誤？
A. 情緒障礙（emotional disturbance）為常出現的臨床徵狀
B. 脈搏壓（pulse pressure）增加
C. 血清甲狀腺素（thyroxine）值高於正常
D. 血清甲狀腺刺激素（TSH）值正常

正確答案：D. 血清甲狀腺刺激素（TSH）值正常